Un paciente consulta por latido vascular cervical prominente. Al auscultarle se escucha un soplo diastólico de alta frecuencia. ¿Cuál es la causa?
1. Ductus persistente.
2. Disfunción músculo papilar.
3. Estenosis mitral.
4. Insuficiencia aórtica.

Respuesta correcta: 4. Insuficiencia aórtica.